El grafito:
1. Da compuestos de intercalación con el flúor.
2. Reacciona con el sodio para dar un compuesto covalente con enlace C ̶ Na.
3. Reacciona con el sodio para dar compuestos de intercalación que tienen la misma distancia entre capas que tenía el grafito puro.
4. Reacciona con el sodio para dar compuestos de intercalación que son mejores conductores eléctricos que el grafito puro.
5. Da compuestos covalentes con el bromo con enlace C ̶ Br.

Respuesta correcta: 4. Reacciona con el sodio para dar compuestos de intercalación que son mejores conductores eléctricos que el grafito puro.